Clinical trial inclusion criteria:
Patients undergoing a loop ileostomy closure

Annotated entities:
- Procedure: "loop ileostomy closure"